下列何種支付制度最容易降低病人就醫可近性（accessibility）？
A. 論病例計酬
B. 論量計酬
C. 論質計酬
D. 論人計酬

正確答案：D. 論人計酬